Clinical trial inclusion criterion:
Platelet count: ≥ 100,000/mm3

Entity relations:
- Has_value("Platelet count", "≥ 100,000/mm3")